Clinical trial exclusion criterion:
Lumbar puncture within the previous two weeks

Entity relations:
- Has_temporal("Lumbar puncture", "within the previous two weeks")